Clinical trial exclusion criterion:
Subjects were not to have a postural drop of 20 mmHg or more in systolic blood pressure at screening.

Annotated entities:
- Measurement: "systolic blood pressure"
- Value: "postural drop of 20 mmHg"
- Temporal: "at screening"
- Negation: "not"